有關腕隧道症候群（carpal tunnel syrdrome）之敘述，下列何者錯誤？
A. 為最常見之神經壓迫症候群
B. 於女性懷孕期間容易出現
C. 尺骨神經減壓手術為其一有效治療方法
D. 常見原因為過度使用手部或因職業病造成手部創傷

正確答案：C. 尺骨神經減壓手術為其一有效治療方法